Clinical trial exclusion criterion:
Current or past diagnoses of other Axis I psychiatric disorders, except for generalized anxiety disorder (GAD) symptoms occurring during a depressive episode

Annotated entities:
- Qualifier: "other"
- Condition: "Axis I psychiatric disorders"
- Negation: "except for"
- Condition: "generalized anxiety disorder (GAD)"
- Temporal: "during a depressive episode"
- Reference_point: "depressive episode"
- Condition: "depressive episode"